Clinical trial exclusion criterion:
With other hemorrhagic diseases and anticoagulant therapy is not allowed;

Annotated entities:
- Condition: "hemorrhagic diseases"
- Qualifier: "other"
- Procedure: "anticoagulant therapy"
- Condition: "not allowed"